Clinical trial exclusion criterion:
previous adverse experience with study drugs

Annotated entities:
- Temporal: "previous"
- Condition: "adverse experience"
- Drug: "study drugs"